Diagnosed diabetes;

The above is a clinical trial exclusion criterion. Annotated with entity spans:
Diagnosed [Condition: diabetes];